溫差測驗（caloric test）主要用來檢測：
A. 水平半規管
B. 垂直半規管
C. 橢圓囊（utricle）
D. 球囊（saccule）

正確答案：A. 水平半規管